Clinical trial inclusion criterion:
English speaking

Annotated entities:
- Non-query-able: "English speaking"